¿Cuál de los siguientes dispositivos intrauterinos (DIU), en condiciones de uso óptimo, tiene una eficacia anticonceptiva durante el primer año similar a la esterilización?:
1. DIU inerte.
2. DIU de cobre.
3. DIU liberador de progesterona.
4. DIU sin marco.

Respuesta correcta: 3. DIU liberador de progesterona.